Para la determinación de bifenilos policlorados es una muestra ambiental por cromatografía de gases, el detector más adecuado sería:
1. De ionización de llama.
2. De captura electrónica.
3. Termoiónico.
4. De fotoionización.
5. Amperométrico.

Respuesta correcta: 2. De captura electrónica.